Clinical trial exclusion criterion:
Prior medical or surgical management of this gestation

Annotated entities:
- Procedure: "medical management"
- Procedure: "surgical management"
- Condition: "gestation"